有關慢性疲勞症候群之敘述，下列何者正確？
A. 最好發於40～60歲之男性
B. 常與EB病毒（EBV）感染相關
C. 絕大多數是心理因素引起
D. 與免疫功能異常無關

正確答案：B. 常與EB病毒（EBV）感染相關